Clinical trial exclusion criterion:
History of noncompliance to medical regimens or unwillingness to comply with the study protocol

Entity relations:
- Has_temporal("noncompliance to medical regimens", "History of")
- Has_mood("comply with the study protocol", "unwillingness to")
- OR("noncompliance to medical regimens", "comply with the study protocol")